What is the effect of NFIA on astrocyte differentiation?

NFIA promotes astrocyte differentiation from neural precursor cells.